Clinical trial exclusion criterion:
Known history of prior intracranial bleeding

Annotated entities:
- Condition: "intracranial bleeding"
- Qualifier: "prior"